Epidural or subdural hematoma

The above is a clinical trial exclusion criterion. Annotated with entity spans:
[Condition: Epidural] or [Condition: subdural hematoma]